Clinical trial inclusion criteria:
Cerebral palsy of any types caused by Neonatal Jaundice

Annotated entities:
- Condition: "Neonatal Jaundice"
- Condition: "Cerebral palsy"